Tras la sístole ventricular el volumen de sangre en el ventrículo es:
1. Cero.
2. El telesistólico.
3. El sistólico.
4. El telediastólico.
5. Mayor en el ventrículo derecho que en el izquierdo.

Respuesta correcta: 2. El telesistólico.